Clinical trial exclusion criterion:
Allergic to sirolimus or serious side effects

Entity relations:
- Has_qualifier("side effects", "serious")
- AND("Allergic", "sirolimus")
- OR("Allergic", "side effects")